Having anaphylactic reaction for Rosuvastatin;

The above is a clinical trial exclusion criterion. Annotated with entity spans:
Having [Condition: anaphylactic reaction] for [Drug: Rosuvastatin];